重症肌無力（myasthenia gravis）的患者會感覺到肌肉疲勞及肌肉無力等現象，通常原因是神經肌肉交界處的乙醯膽鹼（acetylcholine）受器蛋白被患者本身的抗體所破壞。下列敘述何者錯誤？
A. 患者骨骼肌運動終板（motor end-plate）的電位減小
B. 給予乙醯膽鹼酯化酵素（acetylcholinesterase）的抑制劑可改善症狀
C. 乙醯膽鹼的釋放量顯著減少
D. 肌肉動作電位（muscle action potential）的激發（initiation）受阻

正確答案：C. 乙醯膽鹼的釋放量顯著減少